Clinical trial exclusion criterion:
2. Suspected or known digestive tract obstruction, stricture, or perforation

Annotated entities:
- Condition: "digestive tract obstruction"
- Condition: "digestive tract stricture"
- Condition: "digestive tract perforation"
- Parsing_Error: "2."